What is the interaction between WAPL and PDS5 proteins?

Nipped-B, Pds5, and the Wapl protein that interacts with Pds5 all play unique roles in cohesin chromosome binding. Pds5, Wapl, and SA1/2 form a rigid scaffold that docks on Scc1 and anchors the N-terminal domain of Scc1 (Scc1N) to the Smc1 ATPase head Translocation ability is suppressed in the presence of Wapl-Pds5 and Sororin